BMI 30-42

The above is a clinical trial inclusion criterion. Annotated with entity spans:
[Measurement: BMI] [Value: 30-42]